1. Justification: in order to limit exposure to TMS, we will not enroll subjects who have received TMS less than two weeks ago.

The above is a clinical trial exclusion criterion. Annotated with entity spans:
[Parsing_Error: 1.] [Not_a_criteria: Justification: in order to limit exposure to TMS, we will not enroll subjects who have received TMS less than two weeks ago.]